Clinical trial inclusion criterion:
Absence of significant scarring in the pelvis from previous surgeries.

Annotated entities:
- Negation: "Absence"
- Condition: "significant scarring"
- Qualifier: "pelvis"
- Qualifier: "from previous surgeries"
- Temporal: "previous"
- Procedure: "surgeries"